Clinical trial inclusion criterion:
Female or male patients.

Entity relations:
- OR("Female", "male")